Endoscopic and surgical treatment to be provided by same team

The above is a clinical trial inclusion criterion. Annotated with entity spans:
[Procedure: Endoscopic] and [Procedure: surgical treatment] to be provided by same team